Clinical trial exclusion criterion:
People with hypersensitivity to local amide-type anesthetics

Entity relations:
- AND("hypersensitivity", "local amide-type anesthetics")